Clinical trial exclusion criterion:
Secondary Sjögren's syndrome;

Entity relations:
- Has_qualifier("Sjögren's syndrome", "Secondary")